Clinical trial exclusion criterion:
History of meningococcal diseases, confirmed either clinically, serologically, or microbiologically

Annotated entities:
- Condition: "meningococcal diseases"
- Procedure: "serologically"
- Procedure: "microbiologically"
- Value: "confirmed"